What conditions are diagnosed using the scratch collapse test?

Scouring collapse test is used for the diagnosis of cts, cubital tunnel syndrome and carpal tunnel syndrome.